Clinical trial exclusion criterion:
age > 80 years

Annotated entities:
- Person: "age"
- Value: "> 80 years"